Clinical trial exclusion criterion:
Abnormal coagulation profile

Entity relations:
- Has_value("coagulation profile", "Abnormal")
- multi("coagulation profile", "Abnormal coagulation profile")